男性血中睪固酮（testosterone）濃度不足，較不會引起何種症狀或疾病？
A. 性慾下降
B. 勃起功能減退
C. 情緒低落
D. 前列腺癌

正確答案：D. 前列腺癌